Erythropoietin or IV iron in the previous 4 weeks

The above is a clinical trial exclusion criterion. Annotated with entity spans:
[Drug: Erythropoietin] or [Drug: IV iron] [Temporal: in the previous 4 weeks]